Clinical trial inclusion criterion:
Patient has an active pathological bleeding, such as active gastrointestinal (GI) bleeding

Annotated entities:
- Condition: "pathological bleeding"
- Qualifier: "active"
- Qualifier: "active"
- Condition: "gastrointestinal (GI) bleeding"